Clinical trial exclusion criterion:
Inability to walk (bed-bound or wheelchair dependence)

Annotated entities:
- Condition: "Inability to walk"
- Condition: "wheelchair dependence"
- Condition: "bed-bound"